Clinical trial exclusion criterion:
8. STEMI or non-STEMI within the past five days

Entity relations:
- Has_temporal("non-STEMI", "within the past five days")
- Has_temporal("STEMI", "within the past five days")
- OR("STEMI", "non-STEMI")